¿Cuál de las siguientes insulinas se utiliza para la dosis basal en un paciente diabético?
1. Lispro.
2. Aspart.
3. Metformina.
4. Glargina.
5. Regular.

Respuesta correcta: 4. Glargina.